牛羊肝吸蟲是草食性動物常見寄生蟲，請問下列敘述何者正確？
A. "halzoun＂是因生食感染牛羊肝吸蟲成蟲的動物肝臟而造成
B. 幼蟲經由膽管逆流而進入總膽管寄生，所以不會破壞肝組織
C. 牛羊肝吸蟲病以口服 praziquantel 為最佳治療
D. 人類係因食入動物肝臟中之囊狀幼蟲而感染

正確答案：A. "halzoun＂是因生食感染牛羊肝吸蟲成蟲的動物肝臟而造成